Clinical trial exclusion criterion:
Patient with hypersensitivity/allergy to either morphine, NSAIDs, or acetaminophen

Entity relations:
- Subsumes("hypersensitivity", "morphine")
- OR("morphine", "acetaminophen", "NSAIDs")
- OR("hypersensitivity", "allergy")